1. Age ≥ 18 years

The above is a clinical trial inclusion criterion. Annotated with entity spans:
[Parsing_Error: 1.] [Person: Age] [Value: ≥ 18 years]